在不同的游離輻射物質中，有一種游離輻射污染物由岩石或土壤釋放到室內。那一種癌症與這種物質最相關？
A. 大腸癌
B. 肺癌
C. 乳癌
D. 血癌

正確答案：B. 肺癌